Clinical trial exclusion criterion:
Body mass index (BMI) > 45 kg/m2.

Annotated entities:
- Measurement: "Body mass index"
- Measurement: "BMI"
- Value: "> 45 kg/m2"